Clinical trial exclusion criterion:
Has current signs or symptoms of significant medical illness which could interfere with the trial, or require treatment that might interfere with the trial

Annotated entities:
- Condition: "medical illness"
- Qualifier: "significant"
- Observation: "interfere with the trial"
- Mood: "require"
- Procedure: "treatment"
- Observation: "interfere with the trial"